What is caused by SCUBE2 loss-of-function?

Loss-of-function of SCUBE2 causes loss of osteoblast differentiation, bone formation and endochondral bone formation. Loss of the hedgehog signaling pathway plays an important role in skeletal development.